Clinical trial inclusion criterion:
Confirmed presence of iron deficiency

Annotated entities:
- Drug: "iron"
- Condition: "iron deficiency"